List BRAF inhibitors that have been tested in clinical trials for treatment of melanoma patients

Vemurafenib and dabrafenib are BRAF inhibitors that have been tested in clinical trials for treatment of melanoma patients.